History of gastric surgery

The above is a clinical trial exclusion criterion. Annotated with entity spans:
History of [Procedure: gastric surgery]